Clinical trial exclusion criterion:
current self-medication with UU preparations e.g. z.B. Cystinol®, Uvalysat®, Arctuvan®

Entity relations:
- Subsumes("UU preparations", "z.B. Cystinol®")
- Has_qualifier("UU preparations", "self-medication")
- OR("z.B. Cystinol®", "Uvalysat®", "Arctuvan®")